With chronic neurological disorders

The above is a clinical trial exclusion criterion. Annotated with entity spans:
With [Condition: chronic neurological disorders]